A igualdad de afinidad de su Fab, presenta mayor avidez la:
1. IgM.
2. IgE.
3. IgA.
4. IgG
5. IgD.

Respuesta correcta: 1. IgM.